Transforma la angiotensina I en II la:
1. Renina.
2. Enzima convertidora de angiotensina.
3. Aldosterona.
4. Angiotensinasa.

Respuesta correcta: 2. Enzima convertidora de angiotensina.